Any debilitating disease that causes exercise intolerance

The above is a clinical trial exclusion criterion. Annotated with entity spans:
Any [Condition: debilitating disease] that causes [Condition: exercise intolerance]